Heart failure or Chronic renal failure

The above is a clinical trial exclusion criterion. Annotated with entity spans:
[Condition: Heart failure] or [Condition: Chronic renal failure]